Clinical trial inclusion criterion:
History of a solitary renal transplant

Annotated entities:
- Procedure: "renal transplant"
- Qualifier: "solitary"